english-speaking and literate

The above is a clinical trial inclusion criterion. Annotated with entity spans:
[Observation: english-speaking] and [Observation: literate]